Contraindication to Filgrastim

The above is a clinical trial exclusion criterion. Annotated with entity spans:
[Condition: Contraindication] to [Drug: Filgrastim]